Clinical trial exclusion criterion:
Constitutional illness (eg, persistent unexplained fever, diarrhea, significant weight loss, disabling weakness) within 30 days of screening

Entity relations:
- Has_multiplier("unexplained fever", "persistent")
- Has_qualifier("weight loss", "significant")
- Subsumes("Constitutional illness", "unexplained fever")
- Has_temporal("Constitutional illness", "within 30 days of screening")
- OR("unexplained fever", "weight loss", "diarrhea", "disabling weakness")